Clinical trial exclusion criterion:
Active liver disease or unexplained persistent elevations of serum transaminases more than three times normal

Entity relations:
- Subsumes("elevations", "more than three times normal")
- Has_value("serum transaminases", "elevations")
- Has_qualifier("serum transaminases", "persistent")
- Has_qualifier("serum transaminases", "unexplained")
- OR("liver disease", "serum transaminases")